Men and women 18 years of age and older who are able to complete the neuropsychological tests

The above is a clinical trial inclusion criterion. Annotated with entity spans:
[Person: Men] and [Person: women] [Value: 18 years] of [Person: age] and older who are [Observation: able to complete] the [Procedure: neuropsychological tests]